La resonancia iónica de ciclotrón por trasformada de Fourier es el fundamento de:
1. Un sistema de ionización de masas útil para el análisis elemental.
2. Un sistema de atomización que se aplica en absorción atómica para elementos susceptibles de generar hidruros.
3. Un analizador de masas.
4. Un sistema de introducción de la muestra en espectrometría de emisión de plasma.
5. Un sistema detector en espectrometría de masas.

Respuesta correcta: 3. Un analizador de masas.